對於病人不遵從醫囑（non-compliance），醫師應詳察原因並積極加以排除。但下列遵醫囑性不良的原因中，何者醫師僅須尊重病人意願即可，不須積極排除之？
A. 醫病溝通不良
B. 病人對醫師缺乏信賴感
C. 心理或精神因素
D. 醫師與病人價值觀之差異

正確答案：D. 醫師與病人價值觀之差異